Antibiotic use except study drugs

The above is a clinical trial exclusion criterion. Annotated with entity spans:
[Drug: Antibiotic] use [Negation: except] [Drug: study drugs]